下列藥品何者可經由抑制 Leukotriene receptor 的作用，來當作口服治療氣喘的用藥？
A. Zafirlukast
B. Albuterol
C. Theophylline
D. Tiopropium

正確答案：A. Zafirlukast